clinically significant ECG

The above is a clinical trial exclusion criterion. Annotated with entity spans:
[Qualifier: clinically significant] [Procedure: ECG]